Borg dyspnea score > 3 during the 3-min constant rate shuttle walking test at V3

The above is a clinical trial inclusion criterion. Annotated with entity spans:
[Measurement: Borg dyspnea score] [Value: > 3] during the [Temporal: 3-min constant rate shuttle walking test] at [Qualifier: V3]